pregnant or breastfeeding woman

The above is a clinical trial exclusion criterion. Annotated with entity spans:
[Pregnancy_considerations: pregnant or breastfeeding woman]